Clinical trial exclusion criterion:
current prohibited concomitant medication

Entity relations:
- Has_temporal("medication", "concomitant")
- Has_temporal("medication", "current")
- Has_qualifier("medication", "prohibited")